Clinical trial inclusion criterion:
Left ventricular ejection fraction (LVEF) less than or equal to (=<) 40 percent (%).

Annotated entities:
- Measurement: "Left ventricular ejection fraction"
- Measurement: "LVEF"
- Value: "less than or equal to 40 percent"
- Value: "=< 40 %"